Clinical trial inclusion criterion:
Shows high disease activity at Screening and Baseline of both a Total Back Pain score of =4 and a Bath Ankylosing Spondylitis Disease Activity Index (BASDAI) score of >= 4

Entity relations:
- Has_value("Total Back Pain score", "=4")
- Has_value("Bath Ankylosing Spondylitis Disease Activity Index (BASDAI) score", ">= 4")
- Has_temporal("high disease activity", "at Screening and Baseline")
- AND("high disease activity", "Total Back Pain score")
- AND("high disease activity", "Bath Ankylosing Spondylitis Disease Activity Index (BASDAI) score")